Clinical trial exclusion criterion:
Active coagulation disorder not controlled with medication

Entity relations:
- Has_temporal("coagulation disorder", "Active")
- Has_negation("controlled with medication", "not")
- Has_qualifier("coagulation disorder", "controlled with medication")